Clinical trial inclusion criterion:
Male or female = 2 years of age;

Annotated entities:
- Person: "Male"
- Person: "female"
- Value: "= 2 years"
- Person: "age"